Clinical trial exclusion criteria:
uncontrolled hypertension
uncontrolled diabetes
creatinine > 2,5 mg/dl
potassium > 6 mg/dl
acute coronary syndrome
hypertrophic cardiomyopathy

Annotated entities:
- Qualifier: "uncontrolled"
- Condition: "hypertension"
- Qualifier: "uncontrolled"
- Condition: "diabetes"
- Measurement: "creatinine"
- Value: "> 2,5 mg/dl"
- Measurement: "potassium"
- Value: "> 6 mg/dl"
- Condition: "acute coronary syndrome"
- Condition: "hypertrophic cardiomyopathy"